在已開發國家引起人類疾病致死原因中，除了致病原外，下列何因素影響最大？
A. 個人生活型態
B. 環境因素好壞
C. 個人生理狀況
D. 醫療設備好壞

正確答案：A. 個人生活型態